Pregnant or breast feeding

The above is a clinical trial exclusion criterion. Annotated with entity spans:
[Condition: Pregnant] or [Observation: breast feeding]